43 歲女性，G2P1，妊娠 41 週，待產中胎心律發生「晚期減速」（late deceleration），請問下列診斷中何者最為可能？
A. 胎頭壓迫
B. 臍帶壓迫
C. 子宮胎盤功能不足
D. 臍繞頸

正確答案：C. 子宮胎盤功能不足